4. Has an upper arm circumference which is adequate for proper fit of the EMG monitor (at least 14cm).

The above is a clinical trial inclusion criterion. Annotated with entity spans:
[Parsing_Error: 4.] Has an [Measurement: upper arm circumference] which is [Qualifier: adequate for proper fit of the EMG monitor] ([Value: at least 14cm]).